Clinical trial inclusion criterion:
Age 19 years of older

Entity relations:
- Has_value("Age", "19 years of older")